El descenso de la presión arterial:
1. Aumenta la tasa de filtración glomerular.
2. Disminuye la Angiotensina II en plasma.
3. Disminuye la actividad cardiovascular.
4. Aumenta la liberación de aldosterona.

Respuesta correcta: 4. Aumenta la liberación de aldosterona.